Respecto al recién nacido, señale la afirmación correcta:
1. Prematuro inmaduro es aquel cuyo su peso al nacer oscila entre 2.000 y 2.500 gr. y tiene una edad gestacional inferior a 37 semanas.
2. Recién nacido de bajo peso es el que pesa al nacer menos a 2.500 gr. y su edad gestacional es entre 37 y 42 semanas.
3. Recién nacido seudotérmino es el que pesa menos de 2.500 gr. y su edad gestacional es superior a 37 semanas.
4. Prematuros son los recién nacidos con un peso menor a 2.500 gr.
5. Recién nacido postérmino es el que tiene una edad gestacional superior a 40 semanas.

Respuesta correcta: 2. Recién nacido de bajo peso es el que pesa al nacer menos a 2.500 gr. y su edad gestacional es entre 37 y 42 semanas.